¿Cuál de los siguientes antipalúdicos es el de elección para el tratamiento de un paciente diagnosticado de paludismo grave y multirresistente causado por Plasmodium falciparum?
1. Estibogluconato sódico.
2. Primaquina.
3. Cloroquina.
4. Artemisinina.
5. Quinina.

Respuesta correcta: 4. Artemisinina.